Clinical trial exclusion criterion:
The indication for oral anticoagulation, associated with others disease.

Annotated entities:
- Procedure: "oral anticoagulation"
- Mood: "indication for"